Clinical trial inclusion criterion:
Over 18 years of age; Systemically healthy; Non-smoking;

Annotated entities:
- Value: "Over 18 years"
- Person: "age"
- Condition: "Systemically healthy"
- Condition: "Non-smoking"